Todos los virus RNA (-) presentan:
1. Genoma segmentado.
2. Envoltura lipídica.
3. Nucleocápside helicoidal
4. Nucleocápside icosaédrica.
5. Trasncriptasa inversa.

Respuesta correcta: 2. Envoltura lipídica.